Clinical trial exclusion criterion:
Cardiovascular, kidney or hepatic diseases;

Annotated entities:
- Condition: "Cardiovascular diseases"
- Condition: "kidney diseases"
- Condition: "hepatic diseases"